Histological evidence: FL Grade 1-3A/iNHL, with relapsed or refractory disease (iNHL includes LPL/WM, MZL); aNHL, defined as DLBCL, FL Grade 3B, MCL, and transformed NHL with relapsed disease; CLL/SLL, PTCL, or CTCL (with MF/SS) with relapsed or refractory.

The above is a clinical trial inclusion criterion. Annotated with entity spans:
[Procedure: Histological] evidence: [Condition: FL] [Measurement: Grade] [Value: 1-3A]/[Condition: iNHL], with [Condition: relapsed] or [Condition: refractory disease] ([Condition: iNHL] includes [Condition: LPL]/[Condition: WM], [Condition: MZL]); [Condition: aNHL], defined as [Condition: DLBCL], [Condition: FL] [Measurement: Grade] [Value: 3B], [Condition: MCL], and [Condition: transformed NHL] with [Condition: relapsed disease]; [Condition: CLL]/[Condition: SLL], [Condition: PTCL], or [Condition: CTCL] (with [Condition: MF]/[Condition: SS]) with relapsed or refractory.